Clinical trial exclusion criterion:
Patients who have active infections requiring therapy.

Entity relations:
- AND("requiring therapy", "therapy")
- Has_qualifier("infections", "requiring therapy")